To be eligible patients must fulfill the following criteria: Patients on ongoing hypertensive therapy must have a blood pressure ≥ 135/85 mm Hg but lower than 170/105 mm Hg at baseline (Day -1) AND patients must be on stable antihypertensive medications for at least 8 weeks prior to baseline (Day -1).; Newly diagnosed hypertensive patients must have a blood pressure ≥ 135/85 mm Hg but lower than 170/105 mm Hg at baseline (Day -1).

The above is a clinical trial inclusion criterion. Annotated with entity spans:
To be eligible patients must fulfill the following criteria: Patients on ongoing [Procedure: hypertensive therapy] must have a [Measurement: blood pressure] [Value: ≥ 135/85 mm Hg] but [Value: lower than 170/105 mm Hg] at baseline (Day -1) AND patients must be on [Qualifier: stable] [Drug: antihypertensive medications] for [Temporal: at least 8 weeks prior to baseline] (Day -1).; [Qualifier: Newly diagnosed] [Condition: hypertensive patients] must have a [Measurement: blood pressure] [Value: ≥ 135/85 mm Hg] but [Value: lower than 170/105 mm Hg] [Temporal: at baseline (Day -1)].